Which package in Bioconductor has been developed with the aim to analyze differential DNA loops from sequencing data?

diffloop